Clinical trial exclusion criterion:
Known fetal anomaly

Annotated entities:
- Condition: "fetal anomaly"